Contraindication to prostaglandins according to current Parkland protocol

The above is a clinical trial exclusion criterion. Annotated with entity spans:
[Condition: Contraindication] to [Drug: prostaglandins] according to current [Procedure: Parkland protocol]